Clinical trial exclusion criterion:
Estimated life expectancy (due to comorbidities) less than 90 days

Entity relations:
- Has_value("Estimated life expectancy", "less than 90 days")